5. Capacity to provide consent or assent to participate in research

The above is a clinical trial inclusion criterion. Annotated with entity spans:
5. [Non-query-able: Capacity to provide consent or assent to participate in research]